Clinical trial exclusion criterion:
periodontal treatment in the last year (before baseline appointment)

Entity relations:
- multi("baseline appointment", "baseline appointment")
- Has_index("before baseline appointment", "baseline appointment")
- Has_temporal("periodontal treatment", "in the last year")
- Has_temporal("periodontal treatment", "before baseline appointment")